La detoxificación celular de fármacos liposolubles ocurre en:
1. Lisosomas.
2. Complejo de Golgi.
3. Mitocondrias.
4. Retículo endoplásmico liso.

Respuesta correcta: 4. Retículo endoplásmico liso.